Diagnosis of schizophrenia or schizoaffective disorder

The above is a clinical trial inclusion criterion. Annotated with entity spans:
Diagnosis of [Condition: schizophrenia] or [Condition: schizoaffective disorder]